What is a potential alternate uses(repositioning) for Primaquine

Primaquine could be used as a novel drug for vascular leakage by maintaining endothelial integrity and for